Clinical trial exclusion criterion:
No counter indications according to the Medikinet pill.

Annotated entities:
- Non-query-able: "No counter indications according to the Medikinet pill"